Según la Estrategia del Plan Nacional de Drogas (2009-2016), entre los grupos de población beneficiarios de programas y actividades dirigidos a la asistencia e integración social NO se encuentran las personas que:
1. Consumen drogas y que acuden a la red sanitaria general por problemas relacionados con su consumo o por otros problemas de salud.
2. Frecuentan entornos y participan en situaciones donde existe una especial facilidad para el consumo.
3. Están afectadas por patología dual, presentan cuadros comórbidos complicados que se cronifican y empeoran la evolución y el pronóstico del problema adictivo.
4. Estén internas en centros penitenciarios o siguiendo programas alternativos al cumplimiento de penas de prisión.
5. Son menores de edad y consumidores de drogas, internos en centros de protección o reforma.

Respuesta correcta: 2. Frecuentan entornos y participan en situaciones donde existe una especial facilidad para el consumo.